Treatment with a medication that would prohibit the safe concurrent use of methylphenidate such as monoamine oxidase inhibitors and tricyclic antidepressants

The above is a clinical trial exclusion criterion. Annotated with entity spans:
Treatment with a [Drug: medication that would prohibit the safe concurrent use of methylphenidate] such as [Drug: monoamine oxidase inhibitors] and [Drug: tricyclic antidepressants]